有一位年齡7歲的小女孩因長期臉色蒼白而半個月來四肢常無緣無故出現紫斑或牙齦出血而被送來醫院，檢查結果發現無肝脾腫大。血液學呈現血色素（Hb）9.2g/dL，白血球計數 2500/mm3，中性球佔5%，血小板數為25×103/mm3，網狀紅血球矯正後為0.4%。骨髓檢查有核細胞非常稀少，且各血球系都有明顯缺乏現象。下列何者是最有可能的診斷？
A. 急性淋巴性白血病
B. 特異性血小板減少性紫斑症
C. 免疫性溶血性貧血
D. 嚴重再生不良性貧血

正確答案：D. 嚴重再生不良性貧血